Acude a consulta de enfermería un hombre de 55 años para seguimiento de HTA recién diagnosticada. En la valoración comenta que es fumador de 15 cigarros al día. Aprovechando la oportunidad de la consulta, la enfermera le proporciona información sobre la importancia de dejar de fumar y le ofrece apoyo si decide dejarlo. Este tipo de intervención de EpS se considera:
1. Consejo/Información.
2. Atención individual.
3. Promoción de la salud.
4. EpS demandada.
5. Todas son correctas.

Respuesta correcta: 1. Consejo/Información.